Clinical trial inclusion criterion:
Patients with de novo stenotic lesions who are suitable for coronary stenting with drug-eluting stent

Entity relations:
- Has_qualifier("stenotic lesions", "de novo")
- AND("coronary stenting", "drug-eluting stent")
- Has_mood("coronary stenting", "suitable")